Hospitalization for acute decompensated HF within previous 30 days

The above is a clinical trial exclusion criterion. Annotated with entity spans:
[Observation: Hospitalization] for [Condition: acute decompensated HF] [Temporal: within previous 30 days]